Which is the target of belimumab in Systemic Lupus Erythematosus treatment?

The main therapeutic target of belimumab is BLyS